Clinical trial exclusion criteria:
Have a history of myocardial infarction in the past 6 months
Have a contraindication to NRT with no medical clearance from the primary care provider or study physician
Use and unwillingness to stop use of other forms of nicotine such as cigars, pipes, or chewing tobacco
Are pregnant
Meet criteria for a current manic episode based on structured clinical interview
Are currently enrolled in another smoking cessation trial
Are currently imprisoned or in psychiatric hospitalization

Annotated entities:
- Condition: "myocardial infarction i"
- Temporal: "past 6 months"
- Condition: "contraindication"
- Procedure: "NRT"
- Post-eligibility: "Use and unwillingness to stop use of other forms of nicotine such as cigars, pipes, or chewing tobacco"
- Condition: "pregnant"
- Condition: "manic episode"
- Competing_trial: "Are currently enrolled in another smoking cessation trial"
- Person: "imprisoned"
- Observation: "psychiatric hospitalization"